下列何種激素最不可能促進骨骼質量（bone mass）的增加？
A. growth hormone
B. testosterone
C. estrogen
D. cortisol

正確答案：D. cortisol